Clinical trial exclusion criterion:
Males planning to conceive a child during the study or within 6 months of cessation of treatment.

Entity relations:
- Has_mood("conceive a child", "planning to")
- Has_index("within 6 months of cessation of treatment", "cessation of treatment")
- Has_index("during the study", "the study")
- Has_temporal("conceive a child", "during the study")
- OR("during the study", "within 6 months of cessation of treatment")